Clinical trial exclusion criterion:
Active implantable medical device (i.e. DBS, spinal cord stimulator, pacemaker, defibrillator, vagus nerve stimulator, programmable shunt).

Annotated entities:
- Device: "implantable medical device"
- Device: "DBS"
- Device: "spinal cord stimulator"
- Device: "pacemaker"
- Device: "defibrillator"
- Device: "vagus nerve stimulator"
- Device: "programmable shunt"
- Qualifier: "Active"